Clinical trial exclusion criterion:
participant in other trial

Annotated entities:
- Competing_trial: "participant in other trial"